Clinical trial inclusion criterion:
The patients have no history of neoadjuvant hormone therapy.

Entity relations:
- Has_negation("neoadjuvant hormone therapy", "no history")